三心房症（cor triatriatum）的病人，左心房內有一薄膜將之分為上下二個腔室，則下列敘述何者為誤？
A. 上腔室連接肺靜脈血流
B. 下腔室和二尖瓣開口相通
C. 左心耳（left atrial appendage）開口和上腔室相通
D. 一般會合併有心房中膈缺損

正確答案：C. 左心耳（left atrial appendage）開口和上腔室相通